Cardiogenic shock

The above is a clinical trial exclusion criterion. Annotated with entity spans:
[Condition: Cardiogenic shock]